Clinical trial inclusion criterion:
Cervical cerclage 1st or 2nd trimester of pregnancy undergoing with spinal anesthesia

Entity relations:
- AND("Cervical cerclage", "spinal anesthesia")
- Has_qualifier("pregnancy", "1st trimester")
- AND("Cervical cerclage", "pregnancy")
- OR("1st trimester", "2nd trimester")